La glucogenosis tipo II o enfermedad de Pompe tiene su origen en el déficit de la:
1. Glucógeno sintasa.
2. Alfa-glucosidasa ácida.
3. Enzima ramificante.
4. Enzima desramificante.

Respuesta correcta: 2. Alfa-glucosidasa ácida.